抗生素的作用機轉及副作用，下列敘述何者正確？
A. 快速注射萬古黴素（vancomycin）時，最常見的副作用為紅人症候群（red man syndrome），主要的機轉為造成組織胺（histamine）的釋放
B. 頭環孢素（cephalosporin）為抑菌作用，主要作用於抑制蛋白質的合成
C. Quinolones 主要的作用機轉為抑制細胞壁的合成
D. 紅黴素的主要作用機轉為抑制 DNA 合成

正確答案：A. 快速注射萬古黴素（vancomycin）時，最常見的副作用為紅人症候群（red man syndrome），主要的機轉為造成組織胺（histamine）的釋放